Clinical trial exclusion criterion:
Active psychosis or psychotic disorder, severe depression (as determined per clinician prescriber judgment), severe psychiatric instability or severe situational life crisis (including evidence of being actively suicidal or homicidal).

Entity relations:
- Has_qualifier("psychiatric instability", "severe")
- Has_qualifier("situational life crisis", "severe")
- Subsumes("situational life crisis", "suicidal")
- Has_qualifier("psychosis", "Active")
- OR("suicidal", "homicidal")
- OR("psychosis", "psychotic disorder", "severe depression", "psychiatric instability", "situational life crisis")